Clinical trial inclusion criterion:
Meet at least 3 of 5 National Cholesterol Education Adult Treatment Panel III

Annotated entities:
- Value: "at least 3 of 5"
- Measurement: "National Cholesterol Education Adult Treatment Panel III"